Una dislipemia con fenotipo IIa de Fredrickson puede tener su origen en mutaciones en el gen de:
1. El receptor de LDL.
2. La lipoproteína lipasa (LPL).
3. La Apo CII.
4. La Apo A-II.
5. La Apo B-48.

Respuesta correcta: 1. El receptor de LDL.